Clinical trial exclusion criterion:
Women refusing HBs Ag test

Entity relations:
- Has_negation("HBs Ag test", "refusing")